Oximorfona, mepedina, codeína, pentazocina, fentanilo. Todos estos principios activos tienen en común su pertenencia al grupo de:
1. Alucinógenos.
2. Anfetaminas clásicas.
3. Opiáceos.
4. Cannabinoides.

Respuesta correcta: 3. Opiáceos.